Clinical trial inclusion criterion:
Before participate in the study, patients must understand the treatment plan and willing to participate in the study. Patients must have signed an approved informed consent.

Annotated entities:
- Post-eligibility: "Before participate in the study, patients must understand the treatment plan and willing to participate in the study. Patients must have signed an approved informed consent."